一位 48 歲女性有全身性紅斑性狼瘡（SLE）病史，因無月經、躁熱 6 個月來診，主訴背痛，骨密度檢查用 DEXA 測量 T score -2.5。下列處置何者不適當？
A. 補充足夠鈣質及維他命 D
B. 若無禁忌，給予雌性激素補充治療
C. 使用 tibolone 治療
D. 使用 bisphosphonate 治療

正確答案：C. 使用 tibolone 治療